關於輕度智能障礙（mild mental retardation）的敘述，下列何者錯誤？
A. 智商約為70～85，是最常見的智能障礙，約占智能障礙總人數的85%
B. 通常到小學一、二年級才被發現跟不上功課
C. 到國、高中的年紀，其學業能力約相當於小學六年級的學生
D. 合併出現行為規範障礙症（conduct disorder）的機會大於合併出現自閉症（autistic disorder）

正確答案：A. 智商約為70～85，是最常見的智能障礙，約占智能障礙總人數的85%